Please list the drugs associated with Drug-Induced Hypophosphatemia.

Drug induced hypophosphatemia can occur with iron therapy as well a treatment with ferric carboxymaltose,  elotuzumab, cemiplimab, Temsirolimus,  capecitabine, panobinostat, bendamustine, ofatumumab, carboplatin and etoposide (BOCE)